一位 54 歲男性有 18 個月的無力、肌肉萎縮及肌纖維性自發性收縮，因呼吸困難而住院，診斷肌萎縮性側索硬化（amyotrophic lateral sclerosis）。下列有關本例的敘述何者錯誤？
A. 這是運動神經元疾病
B. 脊髓兩側的前角神經元數目減少
C. 兩側的皮質脊髓神經束變性
D. 後神經根比前神經根細

正確答案：D. 後神經根比前神經根細